Una chica de 20 años acude a urgencias porque ha notado tras levantarse, al mirarse al espejo, debilidad en toda la mitad derecha de la cara (incluida la frente, cerrar el párpado y para sonreir). Se acompaña de disgeusia, con sensación de sabor metálico de los alimentos así como de hiperacusia y dolor mastoideo ipsilateral. En la exploración no se evidencia déficit de la fuerza ni déficits sensitivos en extremidades ni alteraciones del habla ni lenguaje. En este caso, ¿cuál de las siguientes aseveraciones es la correcta?
1. El diagnóstico más probable es una placa desmielinizante en hemiprotuberancia contralateral, la exploración complementaria más necesaria sería una resonancia magnética craneal.
2. Los corticoides vía oral son de elección en el tratamiento de la paciente.
3. Debe ser considerada la fibrinolisis endovenosa si el tiempo de evolución es menor a 3 h.
4. Lo más probable es que el cuadro sea irreversible.

Respuesta correcta: 2. Los corticoides vía oral son de elección en el tratamiento de la paciente.